En psicología de la personalidad, cuando se habla de consistencia y estabilidad de la personalidad, se puede estar haciendo referencia a la constatación de que:
1. Los rasgos que muestra la persona son coherentes con su historia ontogenética.
2. Las conductas y situaciones que se equiparan a través de los puntos temporales son similares.
3. La personalidad es la respuesta a las demandas situacionales.
4. Los ítems que evalúan un rasgo mantienen altas correlaciones entre sí.
5. Las conductas estables y consistentes son indicadoras de salud mental.

Respuesta correcta: 2. Las conductas y situaciones que se equiparan a través de los puntos temporales son similares.